Clinical trial exclusion criterion:
Patients with bone metastases as the only site(s) of measurable disease

Annotated entities:
- Condition: "bone metastases"
- Multiplier: "only site(s) of measurable disease"